¿En qué trastorno infanto-juvenil es más adecuado emplear el procedimiento terapéutico de inversión del hábito?:
1. Hiperactividad.
2. Bruxismo.
3. Trastorno obsesivo compulsivo.
4. Trastorno negativista desafiante.

Respuesta correcta: 2. Bruxismo.